舌神經（lingual nerve）內（包括所有伴行）之神經纖維，不包含：
A. 神經細胞體位於三叉神經節（trigeminal ganglion）之感覺神經纖維
B. 傳遞來自舌前三分之二段一般感覺之神經纖維
C. 傳遞舌前三分之二段味覺之神經纖維
D. 控制腮腺（parotid gland）之副交感神經節前纖維

正確答案：D. 控制腮腺（parotid gland）之副交感神經節前纖維